What disease is treated with Laparoscopic Heller Myotomy (LHM)?

Laparoscopic Heller myotomy (LHM) is the preferred surgical method for treating achalasia.